known or presumed liver or renal dysfunction

The above is a clinical trial exclusion criterion. Annotated with entity spans:
[Qualifier: known] or [Qualifier: presumed] [Condition: liver] or [Condition: renal dysfunction]